Planning pregnancy within 2 years of study

The above is a clinical trial exclusion criterion. Annotated with entity spans:
[Mood: Planning] [Condition: pregnancy] [Temporal: within 2 years of study]